Clinical trial exclusion criterion:
No known history of seizure activity.

Annotated entities:
- Negation: "No"
- Temporal: "history"
- Condition: "seizure activity"